Clinical trial inclusion criterion:
Best corrected visual acuity 20/32 - 20/320

Entity relations:
- Has_value("Best corrected visual acuity", "20/32 - 20/320")